Bifurcation lesion requiring 2 stenting technique

The above is a clinical trial exclusion criterion. Annotated with entity spans:
[Condition: Bifurcation lesion] requiring [Multiplier: 2] [Procedure: stenting technique]